Clinical trial exclusion criterion:
not alert

Annotated entities:
- Observation: "not alert"